運動測試（exercise testing）的絕對禁忌症（absolute contraindication）不包含下列那一項？
A. 不穩定心絞痛（unstable angina）
B. 有症狀且嚴重的主動脈狹窄（aortic stenosis）
C. 第一度心房心室阻斷（first degree atrioventricular block）
D. 急性全身性感染症合併發燒、全身酸痛

正確答案：C. 第一度心房心室阻斷（first degree atrioventricular block）